¿Qué autor psicoanalítico trabajaba de una manera diferente a Freud, sentándose frente a frente, con sesiones de una vez por semana y su tratamiento rara vez excedía de un año?
1. Alfred Adler.
2. Carl Jung.
3. M. Klein.
4. A. Freud.
5. J. Lacan.

Respuesta correcta: 1. Alfred Adler.